對於一位肝臟功能異常的病人，其凝血功能測定不會有下列何種表現？
A. fibrinogen 低下
B. prothrombin time 延長
C. aPTT 正常或微增加
D. thrombin time 減少

正確答案：D. thrombin time 減少